Clinical trial exclusion criterion:
General danger signs or symptoms of severe malaria

Annotated entities:
- Condition: "malaria"
- Qualifier: "severe"